Clinical trial inclusion criterion:
Failed at least one antiarrhythmic drug (AAD) (Class I or III antiarrhythmic drugs) as evidenced by recurrent symptomatic AF, or intolerable to the AAD

Entity relations:
- Subsumes("antiarrhythmic drug (AAD)", "Class I antiarrhythmic drugs")
- Has_multiplier("antiarrhythmic drug (AAD)", "at least one")
- AND("intolerable", "AAD")
- OR("Class I antiarrhythmic drugs", "III antiarrhythmic drugs")
- OR("recurrent symptomatic AF", "intolerable")